Clinical trial exclusion criterion:
age <45 or >80

Annotated entities:
- Person: "age"
- Value: "<45 or >80"